Other protocol defined exclusion criteria could apply.

The above is a clinical trial exclusion criterion. Annotated with entity spans:
[Non-representable: Other protocol defined exclusion criteria could apply.]